Clinical trial exclusion criterion:
History of hypertensive encephalopathy or cerebrovascular accident at any time prior to Visit1.

Annotated entities:
- Condition: "hypertensive encephalopathy"
- Condition: "cerebrovascular accident"
- Temporal: "History"
- Temporal: "any time prior"